下列何者會有（14;18）translocation 以及 BCL-2 蛋白質的 overexpression？
A. follicular lymphoma
B. small lymphocytic lymphoma
C. mantle cell lymphoma
D. marginal zone lymphoma

正確答案：A. follicular lymphoma